Clinical trial exclusion criterion:
Child or parent/LAR is an immediate relative of study staff or an employee who is supervised by study staff.

Annotated entities:
- Non-query-able: "Child or parent/LAR is an immediate relative of study staff or an employee who is supervised by study staff."